Clinical trial inclusion criterion:
Diagnosis of type 2 diabetes (HbA1c > 48 mmol/mol)

Entity relations:
- Has_value("HbA1c", "> 48 mmol/mol")